La molecularidad de una reacción elemental corresponde:
1. A la concentración inicial de reactivo.
2. Al número de moléculas que se encuentran para reaccionar.
3. Al número de colisiones de los reactivos por unidad de tiempo.
4. A la concentración final del producto.
5. A la reacción entre la velocidad de reacción y la concentración de reactivo.

Respuesta correcta: 2. Al número de moléculas que se encuentran para reaccionar.